一位 30 歲男性選手在參加划船比賽時，突然發生嚴重下背痛，兩腳疼痛、麻木而且無力，同時無法解小便。此時最可能的診斷是：
A. 腰椎狹窄症
B. 腰椎骨折
C. 腰椎椎間盤突出合併馬尾症候群
D. 背部肌肉或韌帶扭傷

正確答案：C. 腰椎椎間盤突出合併馬尾症候群